Clinical trial exclusion criterion:
The dura damage during surgery

Annotated entities:
- Observation: "dura damage"
- Procedure: "surgery"